Clinical trial exclusion criterion:
Neurodegenerative disorders (i.e. Parkinson disease. LBD, or FTD).

Annotated entities:
- Condition: "Neurodegenerative disorders"
- Condition: "Parkinson disease"
- Condition: "LBD"
- Condition: "FTD"